What do HA and NA stand for with respect to the flue virus, e.g. H1N1?

HA and NA, (sometimes H or N) refer to influenza surface proteins neuraminidase (NA) and hemagglutinin (HA).